Current severe illness, including heart, liver and renal failure, major organ allograft, malignancy requiring parenteral chemotherapy that can not be discontinued for the duration of the trial, or any other conditions which, in the opinion of the Investigator, would make the patient unsuitable for the study.

The above is a clinical trial exclusion criterion. Annotated with entity spans:
Current severe illness, including [Condition: heart], [Condition: liver] and [Condition: renal failure], [Condition: major organ allograft], [Condition: malignancy] requiring parenteral [Procedure: chemotherapy] that can not be discontinued for the duration of the trial, or any other conditions which, in the opinion of the Investigator, would make the patient unsuitable for the study.